有關Henoch-Schönlein purpura的敘述，下列何者正確？
A. 紫斑易出現在軀幹
B. 主要是IgM抗體沈積所引起之血管炎
C. 抗核抗體（antinuclear antibody）陽性
D. 血小板數目正常或增加

正確答案：D. 血小板數目正常或增加